Anaemia not attributed to iron deficiency, e.g. other microcytic anaemia

The above is a clinical trial exclusion criterion. Annotated with entity spans:
[Condition: Anaemia] [Negation: not] [Mood: attributed to] [Drug: iron deficiency], e.g. [Qualifier: other] [Condition: microcytic anaemia]